Ludwig 氏咽峽炎與下列何間隙（space）較無關？
A. 咬肌
B. 下頜下
C. 頦下
D. 舌下

正確答案：A. 咬肌